List STING agonists.

CDN 3'3'-cGAMP
dimethylxanthenone-4-acetic acid 
α-Mangostin